Durante la priorización de una serie de problemas de cuidados que ha ido identificando durante el último año en sus pacientes, usted tiene los siguientes datos a cerca de uno de estos problemas: Severidad = 6; Magnitud = 8; Factibilidad de la intervención = 1; Efectividad de la Intervención = 0,5. Señale la respuesta correcta que representa la aplicación del método Hanlon:
1. 6 + 8 0,5 1.
2. (8 + 6) 0,5 1.
3. 8 + 6 0,5 1 .
4. (8 + 1) 6 0,5.

Respuesta correcta: 2. (8 + 6) 0,5 1.